• Inflammatory back pain

The above is a clinical trial inclusion criterion. Annotated with entity spans:
• [Condition: Inflammatory back pain]